下列何者不屬於先天性血小板缺乏（congenital thrombocytopenia）的疾病？
A. Wiskott-Aldrich syndrome
B. neonatal alloimmune thrombocytopenic purpura
C. amegakaryocytic thrombocytopenia
D. Fanconi anemia

正確答案：B. neonatal alloimmune thrombocytopenic purpura